「淋巴結（lymph node）」具有下列何種特徵？
A. 含有淋巴竇（lymphatic sinus）
B. 僅有輸出淋巴管
C. 有白髓（white pulp）和紅髓（red pulp）
D. 主要功能為過濾血液

正確答案：A. 含有淋巴竇（lymphatic sinus）